Clinical trial exclusion criterion:
the neurosurgeon aim at hearing preservation surgery and do not want to risk gentamicin associated hearing loss

Annotated entities:
- Non-representable: "the neurosurgeon aim at hearing preservation surgery and do not want to risk gentamicin associated hearing loss"